Qué teoría psicosocial considera como desadaptadas a las personas ancianas que intentan mantener los niveles y pautas de actividad previos:
1. Actividad.
2. Vacío de roles.
3. Continuidad.
4. Desvinculación.
5. Dependencia estructurada.

Respuesta correcta: 4. Desvinculación.